下列何者是輔助型 T 細胞（helper T cell）的共同接受器（co-receptor）？
A. CD2
B. CD3
C. CD4
D. CD8

正確答案：C. CD4